Clinical trial exclusion criterion:
Medium or large sized gastric or duodenal varices

Entity relations:
- Has_qualifier("gastric c", "Medium")
- OR("gastric c", "duodenal varices")
- OR("Medium", "large")